33 歲女性患者，因高血壓症多年而住院，住院期間之血壓 150~162/90~98 mmHg 之間，electrolytes： Na+ 145 mmol/L（正常值 135~147），Cl- 107 mmol/L（正常值 98~107），K+ 2.4 mmol/L（正常值 3.4~4.7）。腹部超音波檢查發現右側腎上腺有 1 cm 大小的腫瘤。你認為做下列那一項檢查對診斷最有幫助？
A. 血中 cortisol
B. 血中 aldosterone
C. 尿中 catecholamine 及 VMA
D. 血中 androgen 及 DHEA

正確答案：B. 血中 aldosterone